Pregnancy

The above is a clinical trial exclusion criterion. Annotated with entity spans:
[Condition: Pregnancy]